Clinical trial exclusion criterion:
Acute or chronic pain requiring opioid treatment

Entity relations:
- Has_qualifier("pain", "Acute")
- AND("pain", "opioid treatment")
- OR("Acute", "chronic")